Clinical trial exclusion criterion:
Highly frail patients whose estimated lifespan due to comorbidities by the judgement of the investigator is less than 6 months.

Annotated entities:
- Observation: "lifespan"
- Temporal: "less than 6 months"